Clinical trial exclusion criterion:
Current triglyceride level > 400 mg/dl

Entity relations:
- Has_value("triglyceride level", "> 400 mg/dl")